補體（Complement）是由肝細胞分泌再釋放至血液中，它包含 C1~C9 九個小分子，當其活化後，何者可在細菌表面打洞造成細菌瓦解？
A. C3
B. C3a、C5a
C. C4b2a
D. C5b-9

正確答案：D. C5b-9